≥ 1 prior regimen (min 2 cycles) with antibody conjugate, cytotoxic chemotherapy, or TKI alone or in combination.

The above is a clinical trial inclusion criterion. Annotated with entity spans:
[Multiplier: ≥ 1 prior regimen] ([Multiplier: min 2 cycles]) with [Drug: antibody conjugate], [Procedure: cytotoxic chemotherapy], or [Drug: TKI] alone or in combination.